Clinical trial exclusion criterion:
Absolute contraindication to CMR

Entity relations:
- AND("contraindication", "CMR")